Clinical trial exclusion criterion:
Any diseases may limit the efficacy or safety of the study;

Annotated entities:
- Non-query-able: "Any diseases may limit the efficacy or safety of the study"